Clinical trial exclusion criterion:
AST to platelet ratio index (APRI) =2.0 and Fibrosis-4 (FIB-4) =3.25

Entity relations:
- Has_value("AST to platelet ratio index (APRI)", "=2.0")
- Has_value("Fibrosis-4 (FIB-4)", "=3.25")
- OR("AST to platelet ratio index (APRI)", "Fibrosis-4 (FIB-4)")